Clinical trial exclusion criterion:
Hepatic or renal functions abnormal (alanine aminotransferase or aspartate transaminase or total bilirubin > 1.5 upper limit of normal [ULN], or serum creatinine or blood urea nitrogen > 1.5 ULN);

Entity relations:
- Has_value("Hepatic functions", "abnormal")
- Has_value("renal functions", "abnormal")
- Has_value("alanine aminotransferase", "> 1.5 upper limit of normal [ULN]")
- Has_value("serum creatinine", "> 1.5 ULN")
- Subsumes("Hepatic functions", "alanine aminotransferase")
- OR("Hepatic functions", "renal functions")
- OR("alanine aminotransferase", "aspartate transaminase", "total bilirubin")
- OR("serum creatinine", "blood urea nitrogen")
- OR("alanine aminotransferase", "serum creatinine")